Which metazaon species or taxa are known to lack selenoproteins

Some insect genomes have lost the capacity of synthesizing selenoproteins. Several insect species without selenoproteins have been identified.